Clinical trial exclusion criterion:
Mental instability or incompetence, such that the validity of informed consent or compliance with the trial is uncertain

Annotated entities:
- Post-eligibility: "Mental instability or incompetence, such that the validity of informed consent or compliance with the trial is uncertain"